一位抽菸 20 年的慢性阻塞性肺病（chronic obstructive pulmonary disease）病人，在接受肺功能檢查時，下列何者最不會出現？
A. 肺餘容積（residual volume）增加
B. 肺活量（vital capacity）增加
C. 肺總容量（total lung capacity）增加
D. 第一秒用力呼氣量（FEV1）減少

正確答案：B. 肺活量（vital capacity）增加